Clinical trial inclusion criterion:
Metastatic cervical cancer (CX)

Annotated entities:
- Condition: "Metastatic cervical cancer"